一位 26 歲女老師近兩個月來抱怨全身虛弱無力，但醫院的檢查卻都正常。她整天臥床無法上課或做家事，且對什麼事都提不起興趣。她情緒變得沮喪，思考也較遲鈍，常猶豫不決，半夜常醒來且無法再入睡。她覺得人生無望，不如死掉算了。下列有關此病人之敘述何者有誤？
A. 病人腦中的神經傳導物質異常，主要為血清素及正腎上腺素
B. 此疾病發作年齡愈早及有家族史者，日後較可能出現雙極性情感性疾病
C. 當虛弱無力的症狀獲得改善時，其自殺危險性也隨之減少
D. 此疾病的病程常傾向慢性化及再復發

正確答案：C. 當虛弱無力的症狀獲得改善時，其自殺危險性也隨之減少